Clinical trial inclusion criterion:
BCVA of 77 to 20 letters assessed with the use of ETDRS charts

Annotated entities:
- Measurement: "BCVA"
- Value: "77 to 20 letters"